Clinical trial exclusion criterion:
Amiodarone

Annotated entities:
- Drug: "Amiodarone"